Clinical trial inclusion criteria:
aged = 6 months
sign the informed consent form
the legal guardians participate in all the planned follow-up and be able to comply with all research procedures
the subjects have completed the basic immunization of 2 needle recombinant hepatitis B vaccine, there is no inoculation history of EV71 vaccine, and no history of EV71 infection
the last vaccination intervals = 14 days
temperature = 37<U+2103>
aged = 6 months
sign the informed consent form
the legal guardians participate in all the planned follow-up and be able to comply with all research procedures
there is no inoculation history of EV71 vaccine, and there is no history of EV71 infection
the last vaccination intervals = 14 days
temperature = 37<U+2103>
aged = 8 months
sign the informed consent form
the legal guardians participate in all the planned follow-up and be able to comply with all research procedures
there is no inoculation history of EV71 vaccine, and there is no history of EV71 infection
the last vaccination intervals = 14 days and the last attenuated live vaccine intervals=28days
temperature = 37<U+2103>
aged = 8 months
sign the informed consent form
the legal guardians participate in all the planned follow-up and be able to comply with all research procedures
there is no inoculation history of EV71 vaccine, and there is no history of EV71 infection
the last vaccination intervals = 14 days and the last attenuated live vaccine intervals = 28 days
temperature = 37<U+2103>

Annotated entities:
- Person: "aged"
- Value: "= 6 months"
- Informed_consent: "sign the informed consent form"
- Post-eligibility: "the legal guardians participate in all the planned follow-up and be able to comply with all research procedures"
- Multiplier: "2"
- Drug: "needle recombinant hepatitis B vaccine"
- Negation: "no"
- Drug: "EV71 vaccine"
- Negation: "no"
- Temporal: "history"
- Condition: "EV71 infection"
- Procedure: "inoculation"
- Temporal: "history"
- Observation: "last vaccination intervals"
- Value: "= 14 days"
- Measurement: "temperature"
- Value: "= 37<U+2103>"
- Person: "aged"
- Value: "= 6 months"
- Informed_consent: "sign the informed consent form"
- Post-eligibility: "the legal guardians participate in all the planned follow-up and be able to comply with all research procedures"
- Negation: "no"
- Procedure: "inoculation"
- Temporal: "history"
- Drug: "EV71 vaccine"
- Negation: "no"
- Temporal: "history"
- Condition: "EV71 infection"
- Observation: "last vaccination intervals"
- Value: "= 14 days"
- Measurement: "temperature"
- Value: "= 37<U+2103>"
- Person: "aged"
- Value: "= 8 months"
- Informed_consent: "sign the informed consent form"
- Post-eligibility: "the legal guardians participate in all the planned follow-up and be able to comply with all research procedures"
- Negation: "no"
- Procedure: "inoculation"
- Temporal: "history"
- Drug: "EV71 vaccine"
- Negation: "no"
- Temporal: "history"
- Condition: "EV71 infection"
- Observation: "last vaccination intervals"
- Value: "= 14 days"
- Observation: "last attenuated live vaccine intervals"
- Value: "=28days"
- Measurement: "temperature"
- Value: "= 37<U+2103>"
- Person: "aged"
- Value: "= 8 months"
- Informed_consent: "sign the informed consent form"
- Post-eligibility: "the legal guardians participate in all the planned follow-up and be able to comply with all research procedures"
- Negation: "no"
- Procedure: "inoculation"
- Temporal: "history"
- Drug: "EV71 vaccine"
- Negation: "no"
- Temporal: "history"
- Condition: "EV71 infection"
- Value: "= 28 days"
- Observation: "last attenuated live vaccine intervals"
- Observation: "last vaccination intervals"
- Value: "= 14 days"
- Measurement: "temperature"
- Value: "= 37<U+2103>"